What is CRAO in the context of the eye?

CRAO is the abbreviation for central retinal artery occlusion.